Clinical trial inclusion criterion:
Serum bilirubin less than or equal to 1.5 x institutional upper limit of normal (ULN)

Annotated entities:
- Measurement: "Serum bilirubin"
- Value: "equal to 1.5 x institutional upper limit of normal (ULN)"
- Value: "less than 1.5 x institutional upper limit of normal (ULN)"